Clinical trial exclusion criterion:
History or presence of hypersensitivity or idiosyncratic reaction to deferiprone or deferoxamine;

Entity relations:
- AND("hypersensitivity", "deferiprone")
- OR("deferiprone", "deferoxamine")
- OR("hypersensitivity", "idiosyncratic reaction")